What is formative pluripotency?

Two phases of pluripotency, called naïve and primed, have previously been described. The transcription factor network that governs the naive state is rapidly dismantled prior to upregulation of lineage specification markers, creating an intermediate state that is called formative pluripotency.